Clinical trial inclusion criteria:
Males and females with confirmed disease: Fabry (by GLA enzymes and/or DNA testing) naïve and on ERT, Mitochondrial diseases (electron transport chain and/or DNA testing) or connective tissue diseases (clinical criteria and/or DNA testing when available)
Consenting adults (18 years and older) who agrees and consents to skin biopsy and QSART procedure

Annotated entities:
- Person: "Males"
- Person: "females"
- Grammar_Error: "and"
- Qualifier: "Fabry naïve"
- Procedure: "ERT"
- Procedure: "GLA enzymes"
- Procedure: "DNA testing"
- Condition: "confirmed disease"
- Context_Error: "confirmed disease"
- Condition: "Mitochondrial diseases"
- Procedure: "electron transport chain"
- Procedure: "DNA testing"
- Condition: "connective tissue diseases"
- Procedure: "DNA testing"
- Observation: "clinical criteria"
- Context_Error: "Fabry naïve"
- Post-eligibility: "Consenting adults (18 years and older) who agrees and consents to skin biopsy and QSART procedure"
- Non-query-able: "Consenting adults (18 years and older) who agrees and consents to skin biopsy and QSART procedure"